Clinical trial inclusion criterion:
Eligible patients must meet the following criteria to be enrolled in the study:

Annotated entities:
- Parsing_Error: "Eligible patients must meet the following criteria to be enrolled in the study:"